Clinical trial inclusion criteria:
Have had one prior platinum-based chemotherapy regimen for the treatment of primary disease.
At least 4 weeks since last surgery or radiation therapy.
Must have had a treatment-free interval of greater than 6 months following response to platinum.
ECOG performance status of 0,1, or 2.

Annotated entities:
- Drug: "platinum-based chemotherapy regimen"
- Condition: "primary disease"
- Temporal: "prior"
- Temporal: "At least 4 weeks since last surgery or radiation therapy"
- Reference_point: "last surgery"
- Reference_point: "radiation therapy"
- Condition: "a treatment-free interval"
- Temporal: "greater than 6 months following response to platinum"
- Reference_point: "response to platinum"
- Drug: "platinum"
- Measurement: "ECOG performance status"
- Value: "0"
- Value: "0,1"
- Value: "."